Clinical trial inclusion criterion:
Pinhole visual acuity worse than 20/70 in the affected eye

Entity relations:
- Has_value("Pinhole visual acuity", "worse than 20/70")